Clinical trial inclusion criterion:
The participant has received a levodopa combination drug without change in the dose regimen.

Entity relations:
- Has_qualifier("levodopa combination drug", "without change in the dose regimen")